Clinical trial inclusion criterion:
Newly diagnosed glioblastoma (GBM), WHO grade IV.

Annotated entities:
- Condition: "glioblastoma"
- Condition: "GBM"
- Measurement: "WHO"
- Value: "grade IV"
- Qualifier: "Newly diagnosed"